下列何者含有最少量的結締組織？
A. 腎臟實質
B. 肝臟實質
C. 大腦實質
D. 舌實質

正確答案：C. 大腦實質